COMPLETAR: en el Ciclo de Krebs se producen 4 reacciones de oxidación, en 3 de ellas el aceptor final se electrones es el ___ y en la otra es el ___ :
1. FAD/FMN.
2. NAD+ /FMN.
3. NADP+ /FAD.
4. NAD+ /FAD.
5. FAD/NAD+.

Respuesta correcta: 4. NAD+ /FAD.